Clinical trial inclusion criterion:
Successful cardiac ablation for AF

Annotated entities:
- Procedure: "cardiac ablation"
- Condition: "AF"
- Qualifier: "Successful"